作完超音波及心導管檢查，確定了診斷，此時算出的肺動脈指數（Nakada Index）為 70 U/M2，則其 最佳的治療方式為：
A. 完全矯正
B. 分流手術
C. 肺動脈環縮術
D. 藥物治療就可

正確答案：B. 分流手術